Clinical trial exclusion criterion:
Prior treatment with CPAP.

Entity relations:
- Has_temporal("CPAP", "Prior")